Clinical trial exclusion criterion:
Cancer or other significant co-morbidities implying that the patient's condition is unstable.

Entity relations:
- OR("Cancer", "co-morbidities")